Clinical trial inclusion criterion:
3. Written informed consent

Annotated entities:
- Parsing_Error: "3."